目前診斷Sjögren's症候群，下列何種條件，可診斷原發性乾燥症（primary Sjögren's syndrome）？①口乾 ②眼乾  ③Schirmer's test (+) ④唾液腺體切片異常（超過1 focus淋巴球聚集） ⑤唾液腺功能檢查異常 ⑥血中抗SSA或SSB抗體陽性 ⑦關節疼痛
A. ①②③④
B. ①②⑤⑦
C. ①②③⑤
D. ①②⑥⑦

正確答案：A. ①②③④